Clinical trial exclusion criterion:
Special needs participants who are unable to comprehend study-related instructions (eg, mild to profound mental retardation [intelligence quotient <70], moderate to severe cognitive developmental delay, pervasive development disorders, autism)

Annotated entities:
- Observation: "Special needs"
- Observation: "unable to comprehend instructions"
- Qualifier: "study-related"
- Qualifier: "mild to profound"
- Condition: "mental retardation"
- Measurement: "intelligence quotient"
- Value: "<70"
- Qualifier: "moderate to severe"
- Condition: "cognitive developmental delay"
- Condition: "pervasive development disorders"
- Condition: "autism"